true abstinence (periodic abstinence and withdrawal are not acceptable methods of contraception)

The above is a clinical trial inclusion criterion. Annotated with entity spans:
[Pregnancy_considerations: true abstinence (periodic abstinence and withdrawal are not acceptable methods of contraception)]